Acetylsalicyclic acid (ASA) treatment >1g/day or regular use of Non steroidal anti-inflammatory drug (NSAIDs)

The above is a clinical trial exclusion criterion. Annotated with entity spans:
[Procedure: Acetylsalicyclic acid (ASA) treatment] [Value: >1g/day] or regular use of [Drug: Non steroidal anti-inflammatory drug (NSAIDs)]